El producto mayoritario de la reacción de 3,3dimetil-1-buteno con ácido clorhídrico diluido es:
1. 1-cloro-3,3-dimetilbutano.
2. 1-cloro-2,2-dimetilbutano.
3. 3-cloro-2,2-dimetilbutano.
4. 2-cloro-2,3-dimetilbutano.

Respuesta correcta: 4. 2-cloro-2,3-dimetilbutano.